Clinical trial exclusion criterion:
Upper gastrointestinal surgery history

Entity relations:
- Has_temporal("Upper gastrointestinal surgery", "history")